Contiene un grupo imidazol la cadena lateral de:
1. Arginina.
2. Tirosina.
3. Glutamina.
4. Histidina.
5. Lisina.

Respuesta correcta: 4. Histidina.